Clinical trial inclusion criterion:
severe concurrent disease,

Entity relations:
- Has_temporal("disease", "concurrent")
- Has_qualifier("disease", "severe")